La apófisis pteriogoides pertenece al hueso:
1. Etmoides.
2. Cigomático.
3. Temporal.
4. Esfenoides.
5. Escápula.

Respuesta correcta: 4. Esfenoides.